全身性硬化症（systemic sclerosis）最常侵犯的內臟是：
A. 食道
B. 心臟
C. 腎臟
D. 眼睛

正確答案：A. 食道